The patient has a history of aspirin allergy

The above is a clinical trial exclusion criterion. Annotated with entity spans:
The patient has a [Temporal: history of] [Drug: aspirin] [Condition: allergy]